Clinical trial exclusion criterion:
4. Pregnancy

Annotated entities:
- Parsing_Error: "4."
- Condition: "Pregnancy"